Clinical trial inclusion criterion:
Cholecystectomy or bile duct resection

Annotated entities:
- Procedure: "Cholecystectomy"
- Procedure: "bile duct resection"